Clinical trial exclusion criterion:
Dementia or Mild cognitive impairment at baseline

Annotated entities:
- Condition: "Dementia"
- Condition: "Mild cognitive impairment"
- Measurement: "cognitive impairment"
- Value: "Mild"
- Temporal: "at baseline"